¿Qué dos aminoácidos no proteicos participan en el ciclo de la urea?:
1. Prolina e hidroxiprolina.
2. Ornitina y citrulina.
3. Alanina y arginina.
4. Oxalacetato y malato.
5. Serina y GABA.

Respuesta correcta: 2. Ornitina y citrulina.